Clinical trial exclusion criterion:
Subject has a known contraindication to MRE or IC.

Annotated entities:
- Condition: "contraindication"
- Procedure: "MRE"
- Procedure: "IC"